No contraindication to chemoradiotherapy.

The above is a clinical trial inclusion criterion. Annotated with entity spans:
[Negation: No] [Condition: contraindication] to [Procedure: chemoradiotherapy].